原開發廠的新藥成本較高，售價昂貴的原因，以下那一項因素的影響較小？
A. 研究及發展費用
B. 專利權的保護
C. 臨床試驗的花費
D. 生產製造的成本

正確答案：D. 生產製造的成本